Clinical trial inclusion criterion:
planned eye surgery under sedation

Entity relations:
- multi("under sedation", "sedation")
- Has_mood("eye surgery", "planned")
- Has_qualifier("eye surgery", "under sedation")